Clinical trial exclusion criterion:
Patients with a systemic or metabolic disorder leading to progressive bone deterioration

Annotated entities:
- Condition: "metabolic disorder"
- Condition: "systemic disorder"
- Condition: "bone deterioration"
- Qualifier: "progressive"